Clinical trial exclusion criterion:
Currently pregnant

Annotated entities:
- Condition: "pregnant"